Clinical trial exclusion criterion:
Current or planned psychotherapy

Annotated entities:
- Mood: "planned"
- Temporal: "Current"
- Procedure: "psychotherapy"